Patient is hemodynamically unstable on POD 15

The above is a clinical trial exclusion criterion. Annotated with entity spans:
Patient is [Condition: hemodynamically unstable] on [Measurement: POD 15]